Clinical trial inclusion criterion:
Children receiving amoxicilline-clavulanic acid (50-90 mg/kg/day, twice daily) due to acute otitis media or acute sinusitis

Annotated entities:
- Drug: "amoxicilline-clavulanic acid"
- Person: "Children"
- Value: "50-90 mg/kg/day"
- Multiplier: "twice daily"
- Condition: "acute otitis media"
- Condition: "acute sinusitis"